Clinical trial exclusion criterion:
respiratory disease, acute infection or chronic disease activity period

Annotated entities:
- Condition: "respiratory disease"
- Condition: "acute infection"
- Condition: "chronic disease activity period"